Clinical trial inclusion criterion:
Aged 18 years or older, male or female.

Entity relations:
- Has_value("Aged", "18 years or older")
- OR("male", "female")